Clinical trial inclusion criterion:
Has had no recent close contact with a person with active TB or, if there has been such contact, will undergo additional evaluations and receive appropriate treatment for latent TB

Entity relations:
- Has_temporal("close contact", "recent")